Under which environment does SELANSI run?

matlab environment